Clinical trial exclusion criterion:
Decompensated heart failure

Annotated entities:
- Condition: "heart failure"
- Qualifier: "Decompensated"